關於微創手術（minimally invasive surgery）的敘述，下列何者錯誤？
A. 微創手術的好處包括減少術後疼痛及腸道功能恢復較快，因此改善了大腸癌患者術後的生活品質
B. 微創手術的運用並不會不利於大腸癌的治療
C. 微創手術無法像傳統開腹手術一樣有清楚的手術視野
D. 隨著微創手術訓練的進展，腹腔鏡手術的普及性已逐年提高

正確答案：C. 微創手術無法像傳統開腹手術一樣有清楚的手術視野